Which pathological conditions are caused by mutations in the CYLD gene?

Since loss of CYLD expression can be observed in different types of human cancer, it is now well established that CYLD acts as a tumor suppressor gene. Pathogenic mutations in CYLD can be identified in patients affected with Brooke-Spiegler syndrome, (Familial) Cylindromatosis or multiple familial trichoepithelioma. CYLD expression has also been reported to be  dramatically downregulated in basal cell carcinoma (BCC), the most common cancer in humans.